Clinical trial exclusion criterion:
Patients with genetic diseases such as galactose intolerance, Lapp lactase deficiency, or glucose-galactose malabsorption.

Entity relations:
- Subsumes("genetic diseases", "galactose intolerance")
- OR("galactose intolerance", "Lapp lactase deficiency", "glucose-galactose malabsorption")